Clinical trial inclusion criterion:
Active cell phone with text messaging capability

Annotated entities:
- Observation: "Active cell phone with text messaging capability"